Daily use of pain killers

The above is a clinical trial exclusion criterion. Annotated with entity spans:
[Multiplier: Daily] use of [Drug: pain killers]